Clinical trial exclusion criterion:
Liver or kidney failure.

Entity relations:
- OR("Liver failure", "kidney failure")